Clinical trial exclusion criterion:
Meets criteria for Major Depressive Episode, by Diagnostic Statistical Manual of Mental Disorder - IV (TR) criteria

Annotated entities:
- Condition: "Major Depressive Episode"
- Measurement: "Diagnostic Statistical Manual of Mental Disorder - IV (TR) criteria"
- Value: "Meets"